Clinical trial exclusion criterion:
active ocular or periocular infection

Entity relations:
- Has_qualifier("ocular infection", "active")
- OR("ocular infection", "periocular infection")